Clinical trial exclusion criterion:
Subjects who are unable to undergo the MRI

Entity relations:
- Has_mood("MRI", "unable to")